Has given written informed consent before any study-related activity is performed

The above is a clinical trial inclusion criterion. Annotated with entity spans:
[Informed_consent: Has given written informed consent before any study-related activity is performed]